Clinical trial exclusion criterion:
4. Severe hypoglycemic episode within 1 month of screening.

Entity relations:
- Has_qualifier("hypoglycemic episode", "Severe")
- Has_temporal("hypoglycemic episode", "within 1 month of screening")